a cardioembolic event, which occurred on anticoagulation, or

The above is a clinical trial inclusion criterion. Annotated with entity spans:
a [Condition: cardioembolic event], which [Temporal: occurred on anticoagulation], or